Clinical trial inclusion criterion:
Subject is ≥ 18 years of age

Entity relations:
- Has_value("age", "≥ 18 years")